Clinical trial inclusion criterion:
Liver Transplant Recipients have been treated with twice-daily regimen of tacrolimus(TAC) plus everolimus(EVR) and TAC and EVR trough levels have stayed within targeted ranges for at least 6 weeks prior to enrollment

Annotated entities:
- Person: "Liver Transplant Recipients"
- Multiplier: "twice-daily"
- Drug: "tacrolimus(TAC)"
- Drug: "everolimus(EVR)"
- Measurement: "TAC trough levels"
- Measurement: "EVR trough levels"
- Value: "within targeted ranges"
- Temporal: "for at least 6 weeks prior to enrollment"
- Reference_point: "enrollment"